Clinical trial inclusion criterion:
Normal Hormonal investigation: TSH,PRL,FBS

Annotated entities:
- Qualifier: "Normal"
- Measurement: "Hormonal investigation"
- Measurement: "TSH"
- Measurement: "PRL"
- Measurement: "FBS"